成年人之輕度智能不足相當於心智年齡（mental age）多少歲？
A. 12-15 歲
B. 9-12 歲
C. 6-9 歲
D. 6 歲以下

正確答案：B. 9-12 歲